Clinical trial exclusion criteria:
History of ischaemic heart disease, cardiac failure, cerebrovascular disease, liver impairment (ALT/AST>50IU/L) or stage 3-5 chronic kidney disease.
History of overdose or suicidal ideation
Patients weighing <55kgs.
Patients with chronic pain requiring treatment, with a known allergy to paracetamol, or concomitant use of non-steroidal anti-inflammatories , oral anticoagulants or corticosteroids.

Annotated entities:
- Condition: "ischaemic heart disease"
- Condition: "cardiac failure"
- Condition: "cerebrovascular disease"
- Condition: "liver impairment"
- Measurement: "ALT"
- Measurement: "AST"
- Value: ">50IU/L"
- Measurement: "stage"
- Value: "3-5"
- Condition: "chronic kidney disease"
- Condition: "overdose"
- Condition: "suicidal ideation"
- Measurement: "weighing"
- Value: "<55kgs"
- Condition: "chronic pain"
- Qualifier: "requiring treatment"
- Condition: "known allergy"
- Drug: "paracetamol"
- Drug: "non-steroidal anti-inflammatories"
- Temporal: "concomitant"
- Drug: "oral anticoagulants"
- Drug: "corticosteroids"